Clinical trial exclusion criterion:
type 1 diabetic or non-diabetic

Annotated entities:
- Condition: "type 1 diabetic"
- Condition: "non-diabetic"